下列有關阿茲海默症（Alzheimer's disease）之敘述，何者錯誤？
A. 為最常見之失智症
B. 過去曾有腦傷是將來罹患阿茲海默症之危險因子
C. 女性較容易罹患阿茲海默症
D. 第 19 對染色體有 ApoE2 基因者較易得阿茲海默症

正確答案：D. 第 19 對染色體有 ApoE2 基因者較易得阿茲海默症